List factors that promote lymphangiogenesis.

VEGF-C
VEGF-D
VEGF-R3